Subjects who have initiated psychotherapy in the last 4 months prior to the first visit.

The above is a clinical trial exclusion criterion. Annotated with entity spans:
Subjects who have initiated [Procedure: psychotherapy] [Temporal: in the last 4 months prior to the first visit].